Clinical trial inclusion criterion:
Cervical length of 15-25 mm by transvaginal sonography (TVS) at 16-24 weeks of gestation.

Annotated entities:
- Measurement: "Cervical length"
- Value: "15-25 mm"
- Procedure: "transvaginal sonography (TVS)"
- Value: "16-24 weeks"
- Measurement: "gestation"
- Temporal: "at 16-24 weeks of gestation"
- Reference_point: "16-24 weeks of gestation"